Clinical trial exclusion criterion:
Female subjects with a positive urine pregnancy test

Entity relations:
- Has_value("urine pregnancy test", "positive")